Son signos y síntomas de ansiedad grave:
1. Taquicardias y náuseas.
2. Disminución de la atención y temblores.
3. Vómitos y agitación psicomotriz.
4. Insomnio y malestar.
5. Percepción distorsionada e incapacidad para comunicarse.

Respuesta correcta: 1. Taquicardias y náuseas.